Subject has any history of previous transient ischemic attack or stroke.

The above is a clinical trial exclusion criterion. Annotated with entity spans:
Subject has any history of previous [Condition: transient ischemic attack] or [Condition: stroke].